一位34歲，懷孕36週婦女，因陰道大量出血前來求診，血壓90/60 mmHg，脈搏120/min，體溫37℃，超音波顯示胎盤位於子宮頸位置。請依此回答下列3題：下列處置何者為佳？
A. 給予安胎藥
B. 催生終止妊娠
C. 指診檢查子宮張開及病變程度
D. 剖腹生產

正確答案：D. 剖腹生產